Clinical trial inclusion criterion:
HbA1c between 7.1% and 11.0%, inclusive.

Annotated entities:
- Measurement: "HbA1c"
- Value: "between 7.1% and 11.0%, inclusive"